下列有關乳房纖維囊腫（Fibrocystic change）的描述，何者為非？
A. 症狀包括腫塊、疼痛
B. 停經後症狀會減輕
C. 有此變化之大部分婦女之乳癌發生率與一般人同
D. 手術為最佳治療方式

正確答案：D. 手術為最佳治療方式